eGFR at least 60 ml/mn

The above is a clinical trial inclusion criterion. Annotated with entity spans:
[Measurement: eGFR] [Value: at least 60 ml/mn]